Clinical trial exclusion criterion:
Type I DM

Annotated entities:
- Condition: "Type I DM"